Clinical trial exclusion criterion:
Patients with Acute Myocardial Infarction (ST elevation myocardial infarction, Non ST elevation myocardial infarction)

Annotated entities:
- Condition: "Acute Myocardial Infarction"
- Condition: "ST elevation myocardial infarction"
- Condition: "Non ST elevation myocardial infarction"